Clinical trial exclusion criterion:
Gadolinium intolerance

Annotated entities:
- Condition: "intolerance"
- Drug: "Gadolinium"